Clinical trial inclusion criterion:
BV positive by Nugent score

Entity relations:
- Has_value("BV", "positive")
- AND("BV", "Nugent score")